Clinical trial inclusion criterion:
Written maternal informed consent

Annotated entities:
- Post-eligibility: "Written maternal informed consent"